¿Cuál de las siguiente afirmaciones es cierta con respecto al alcaloide morfina?:
1. Es un alcaloide isoquinoleíco extraído de paja de Papaver somniferum.
2. Es un alcaloide bencilisoquinoleico extraído de latex de Papaver somniferum.
3. Es un alcaloide tropánico extraído de hojas de Papaver somniferum.
4. Es un alcaloide quinolizidínico extraído de cápsulas de Papaver somniferum.
5. Es un alcaloide pirrolicidínico extraído de raíces de Papaver somniferum.

Respuesta correcta: 2. Es un alcaloide bencilisoquinoleico extraído de latex de Papaver somniferum.